Clinical trial exclusion criterion:
History of intolerance to colchicine

Annotated entities:
- Condition: "intolerance"
- Drug: "colchicine"